Ongoing participation in a prior clinical study at the time of screening.

The above is a clinical trial exclusion criterion. Annotated with entity spans:
[Context_Error: Ongoing participation in a prior clinical study at the time of screening.]